Clinical trial exclusion criterion:
history of hypersensitivity to test drugs

Entity relations:
- AND("hypersensitivity", "test drugs")
- Has_temporal("hypersensitivity", "history")